Mujer de 82 años hipertensa en tratamiento con atenolol, hidroclorotiazida y digoxina. Acude a urgencias por fibrilación auricular y se le administra verapamil i.v. Se evidencia en ECG bloqueo auriculoventricular completo. ¿Cuál es la causa más probable de esta situación clínica?
1. Intoxicación digitálica por interacción farmacocinética por verapamilo.
2. Hipopotasemia por la administración de tiazida y digoxina.
3. Interacción farmacodinámica del betabloqueante, digoxina y verapamil.
4. Efecto hipotensor del diurético tiazídico.
5. Arritmia cardiaca por verapamil.

Respuesta correcta: 3. Interacción farmacodinámica del betabloqueante, digoxina y verapamil.